Clinical trial exclusion criterion:
Children will be excluded if they have a history of developmental delay or inability to communicate the effects of an allergic reaction (non-verbal).

Annotated entities:
- Person: "Children"
- Condition: "developmental delay"
- Condition: "inability to communicate the effects"
- Condition: "allergic reaction"
- Qualifier: "non-verbal"